一般而言，Fluconazole對下列何種黴菌無療效？
A. Candida albicans
B. Candida krusei
C. Candida tropicalis
D. Candida parapsilosis

正確答案：B. Candida krusei